Clinical trial inclusion criteria:
Patient over 18 years weighing between 65 and 85 Kg
Referred for STEMI within 6 hours from beginning of chest pain or stable coronary artery disease requiring a loading dose of Prasugrel or Ticagrelor according to the international recommendations.
No previous treatment with Clopidogrel, Prasugrel or Ticagrelor.
Patient fasting for at least 6 hours.
Affiliate or receiving a social security system.
Written informed consent.

Annotated entities:
- Person: "years"
- Value: "over 18"
- Measurement: "weighing"
- Value: "between 65 and 85 Kg"
- Condition: "STEMI"
- Multiplier: "loading dose"
- Drug: "Prasugrel"
- Drug: "Ticagrelor"
- Temporal: "within 6 hours from beginning of chest pain"
- Reference_point: "beginning of chest pain"
- Condition: "coronary artery disease"
- Qualifier: "stable"
- Condition: "chest pain"
- Negation: "No"
- Drug: "Clopidogrel"
- Drug: "Prasugrel"
- Drug: "Ticagrelor"
- Temporal: "previous"
- Procedure: "treatment"
- Observation: "fasting"
- Temporal: "for at least 6 hours."
- Non-query-able: "Affiliate or receiving a social security system"
- Observation: "Written informed consent"